一位30歲平常健康良好的男性，主訴2～3週來易倦。理學檢查發現結膜蒼白無黃疸、頸部兩側多個不足一公分大小淋巴結、無肝脾腫大，下肢出現無癢紅色細小斑點；末梢血檢查結果顯示：WBC 1280/µL，N/L/Mo = 5/94/1，Hb 7.5 gm/dL，MCV 86 fL，Platelet 8,000/µL， ALT 42 U/L，T. Bil 0.6 mg/dL，Cr 1.1 mg/dL，Alb 3.7 g/dL。下列何種檢	最有利於正確診斷？
A. 淋巴結切片（biopsy）
B. 正子造影（positron emission tomography, PET）
C. 骨髓切片
D. 血液培養（blood culture）

正確答案：C. 骨髓切片